Clinical trial inclusion criterion:
Patients presenting for abdominal myomectomy with documented uterine fibroids on pelvic imaging (pelvic ultrasound or MRI) within in last 12 months

Entity relations:
- Subsumes("pelvic imaging", "pelvic ultrasound")
- AND("pelvic imaging", "uterine fibroids")
- Has_temporal("pelvic imaging", "within in last 12 months")
- AND("abdominal myomectomy", "pelvic imaging")
- OR("pelvic ultrasound", "MRI pelvic")